Se considera que proporcionar una explicación racional que dé cuenta de los problemas del cliente o paciente y del tratamiento adecuado, es:
1. Un ingrediente terapéutico especifico.
2. El proceder más habitual y central de los terapeutas sistémicos.
3. Un factor común de la psicoterapia.
4. Sólo se debe hacer cuando el cliente o paciente da muestra de resistencia.

Respuesta correcta: 3. Un factor común de la psicoterapia.